Glomerular filtration rate (GFR) ≥ 40 ml/min (estimated using Modification of Diet in Renal Disease (MDRD) formula) in the last 4 months.

The above is a clinical trial inclusion criterion. Annotated with entity spans:
[Measurement: Glomerular filtration rate (GFR)] [Value: ≥ 40 ml/min] (estimated using [Qualifier: Modification of Diet in Renal Disease (MDRD) formula]) [Temporal: in the last 4 months].